Clinical trial inclusion criteria:
The informed consent has been obtained from the patient.
With confirmed diagnosis of stage II colon cancer.
With moderate/good ECOG health rating (PS): 0-1 score.
The patient receive no anti-cancer treatment before primary surgery.
The patient receive radical operation for colon cancer with negative margin.

Annotated entities:
- Non-query-able: "The informed consent has been obtained from the patient."
- Post-eligibility: "The informed consent has been obtained from the patient."
- Condition: "colon cancer"
- Qualifier: "stage II"
- Measurement: "ECOG health rating (PS)"
- Value: "0-1 score"
- Value: "moderate/good"
- Drug: "anti-cancer treatment"
- Negation: "no"
- Temporal: "before primary surgery"
- Procedure: "primary surgery"
- Reference_point: "primary surgery"
- Procedure: "radical operation negative margin"
- Condition: "colon cancer"